1. Male and female subjects must be 18 years of age or older and ambulatory.

The above is a clinical trial inclusion criterion. Annotated with entity spans:
1. [Person: Male] and [Person: female] subjects must be [Value: 18 years] of [Person: age] or older and [Visit: ambulatory].